Fibrinolytics within 24 hours

The above is a clinical trial exclusion criterion. Annotated with entity spans:
[Procedure: Fibrinolytics] [Temporal: within 24 hours]